關於產後發燒的敘述，下列何者錯誤？
A. 產褥熱定義為產後期測得體溫在38℃以上
B. 乳腺炎大部分是兩側同時感染
C. 產後持續性發燒最常見的原因是生殖道感染
D. 乳腺炎最常見的細菌是Staphylococcus aureus

正確答案：B. 乳腺炎大部分是兩側同時感染